前列腺特定抗原（PSA）在不同的年齡層，有不一樣的正常值範圍，下列敘述何者錯誤？
A. 40～49歲，PSA正常值範圍是0.0～2.5 ng/mL
B. 50～59歲，PSA正常值範圍是0.0～4.0 ng/mL
C. 60～69歲，PSA正常值範圍是0.0～4.5 ng/mL
D. 70～79歲，PSA正常值範圍是0.0～6.5 ng/mL

正確答案：B. 50～59歲，PSA正常值範圍是0.0～4.0 ng/mL